La estimulación de los barorreceptores aumenta la:
1. Liberación de adrenalina.
2. Estimulación vagal.
3. Liberación de ADN.
4. Vasoconstricción.

Respuesta correcta: 2. Estimulación vagal.